Clinical trial exclusion criterion:
Increase in creatinine of 15% or greater within one month (30 days) of the screening visit

Entity relations:
- Has_value("creatinine", "Increase of 15% or greater")
- Subsumes("within one month", "30 days")
- Has_temporal("creatinine", "within one month")